Clinical trial exclusion criterion:
10. Disseminated intravascular coagulation (DIC) (diagnosis by laboratory or clinical assessment)

Annotated entities:
- Condition: "Disseminated intravascular coagulation (DIC)"